Subjects with a history of difficulty in providing blood samples

The above is a clinical trial exclusion criterion. Annotated with entity spans:
Subjects with a [Temporal: history] of [Observation: difficulty in providing blood samples]